La onda de pulso arterial:
1. Se amortigua y desaparece en los capilares.
2. Provoca los cambios de presión en las venas.
3. Se propaga a la misma velocidad que la sangre.
4. Es directamente proporcional a la distensibilidad arterial.

Respuesta correcta: 1. Se amortigua y desaparece en los capilares.